Clinical trial exclusion criterion:
Known history of non-compliance to treatment.

Annotated entities:
- Non-query-able: "Known history of non-compliance to treatment"